Awaiting cardiac transplantation or other cardiac surgery within the next 365 days (12 months)

The above is a clinical trial exclusion criterion. Annotated with entity spans:
[Mood: Awaiting] [Procedure: cardiac transplantation] or other [Procedure: cardiac surgery] [Temporal: within the next 365 days] (12 months)